¿Qué modelo de Terapia Familiar plantea que el cambio se produce cuando se reemplaza el juego familiar patológico por otro juego menos perjudicial?
1. Terapia del grupo de Milán.
2. Terapia de MRI de Palo Alto.
3. Terapia centrada en soluciones.
4. Terapia estructural.
5. Terapia estratégica.

Respuesta correcta: 1. Terapia del grupo de Milán.